Clinical trial inclusion criterion:
Open, video-assisted thoracoscopic or robotic surgeries

Annotated entities:
- Procedure: "robotic surgeries"
- Qualifier: "video-assisted"
- Procedure: "thoracoscopic surgeries"